有關腰三角的敘述，下列何者不正確？
A. 闊背肌構成其邊界之一
B. 腹內斜肌構成其底部
C. 可能發生腹部疝氣的位置
D. 髂棘構成三角下緣

正確答案：D. 髂棘構成三角下緣